一位 72 歲男性患有慢性 C 型肝炎多年，超音波檢查發現有肝硬化及一顆直徑 3 公分腫瘤在右葉，且距肝臟表面 2.5 公分，血清胎兒蛋白為 2,019 ng/mL（正常值＜20 ng/mL），患者身體狀況大致良好，電腦斷層顯示只有一顆 3 公分腫瘤，無侵犯血管。進一步肝功能檢查（AST、ALT 等）數值正常， Prothrombin time 及血小板數值正常，在此狀況之初步治療計畫，下列何者最不應優先考慮？
A. 抗癌藥物化學治療（systemic chemotherapy）
B. 手術切除（surgical resection）
C. 腫瘤燒灼（radiofrequency ablation of the tumor）
D. 肝動脈栓塞（hepatic arterial chemoembolization）

正確答案：A. 抗癌藥物化學治療（systemic chemotherapy）